Clinical trial exclusion criterion:
Allergy to tranexamic acid, floseal, rivaroxaban, or the excipients

Entity relations:
- Subsumes("Allergy", "tranexamic acid")
- OR("tranexamic acid", "rivaroxaban", "floseal", "excipients")